Clinical trial inclusion criterion:
index event is an acute complication (< 30 days) of PCI

Entity relations:
- Has_qualifier("complication of PCI", "acute")
- Subsumes("acute", "< 30 days")